Clinical trial exclusion criterion:
Preexistent chronic renal failure.

Entity relations:
- Has_temporal("chronic renal failure", "Preexistent")